Serum creatinine > 1.5 x ULN

The above is a clinical trial exclusion criterion. Annotated with entity spans:
[Measurement: Serum creatinine] [Value: > 1.5 x ULN]